關於落葉型天疱瘡（pemphigus foliaceus）的敘述，下列何者錯誤？
A. 好犯部位包括頭、臉及軀幹上半部
B. 常以紅斑、糜爛與結痂病灶呈現
C. 病灶的組織病理檢查可見表皮下水疱
D. 病灶的直接免疫螢光檢查可見 IgG 沉積於表皮層角質細胞間

正確答案：C. 病灶的組織病理檢查可見表皮下水疱